一個7天大的新生兒有發紺現象，身體診察聽到分裂的第一心音與第二心音，左側胸骨線出現第三度收縮期的心雜音。胸部X光顯示心臟有擴大情形，心電圖顯示心軸右偏與右心房擴大。此新生兒的診斷較可能是：
A. 主動脈窄縮（Coarctation of aorta）
B. 左心發育不全症候群（Hypoplastic left heart syndrome）
C. 法洛氏四重症（Tetralogy of Fallot）
D. 艾伯斯坦異常（Ebstein anomaly）

正確答案：D. 艾伯斯坦異常（Ebstein anomaly）